previous LAA ligation during cardiac surgery;

The above is a clinical trial exclusion criterion. Annotated with entity spans:
previous [Procedure: LAA ligation] during [Procedure: cardiac surgery];